Clinical trial exclusion criterion:
COPD

Annotated entities:
- Condition: "COPD"